卵巢癌的治癒率偏低，其主要的原因為何？
A. 目前化療藥物反應仍不好
B. 因為復發後的治療方式只有化療一途
C. 卵巢癌的組織型態較為惡性
D. 因為確診的案例，大部分是較晚期（如 stage III, IV）

正確答案：D. 因為確診的案例，大部分是較晚期（如 stage III, IV）